Unstable angina;

The above is a clinical trial exclusion criterion. Annotated with entity spans:
[Condition: Unstable angina];